健康男性因社區感染肺炎住院，痰液濃稠且顯微鏡檢查顯示有許多多核白血球及細胞內成對的格蘭氏陽性球菌，痰液培養結果只有正常菌叢（normal flora），則最可能的致病菌是下列那一項：
A. Legionella pneumophila
B. Streptococcus pneumoniae
C. Staphylococcus aureus
D. Enterococcus faecalis

正確答案：B. Streptococcus pneumoniae